What genes is implicated in myotonic goats and other  nondystrophic myotonias?

The gene encoding clcn1, mphanl1, gcic-1, scn4a, clc-1 and dmpk are implicated in myotonic goats and other nondystrophic myotonias